18 years or older

The above is a clinical trial inclusion criterion. Annotated with entity spans:
[Value: 18 years or older]